Clinical trial inclusion criterion:
type 2 diabetic, age 18 and over, informed consent,

Annotated entities:
- Condition: "type 2 diabetic"
- Person: "age"
- Value: "18 and over"
- Informed_consent: "informed consent"